Those who have had a transplant.

The above is a clinical trial exclusion criterion. Annotated with entity spans:
Those who have had a [Procedure: transplant].